PROM

The above is a clinical trial exclusion criterion. Annotated with entity spans:
[Condition: PROM]